For patients >= 40 years of age: any one of the following:

The above is a clinical trial inclusion criterion. Annotated with entity spans:
For patients [Value: >= 40 years] of [Person: age]: any one of the following: